下列何者不是梅毒螺旋體（Treponema pallidum）的特徵？
A. 無法在不含細胞的培養基中生長
B. 菌體為纖細螺旋狀
C. 為革蘭氏染色陽性細菌
D. 生長速率較一般細菌緩慢

正確答案：C. 為革蘭氏染色陽性細菌